有關顱內靜脈竇（venous sinuses）之敘述，何者錯誤？
A. 上矢狀竇（superior sagittal sinus）內之血液流向竇匯（confluence of sinuses）
B. 乙狀竇（sigmoid sinus）直接承接橫竇（transverse sinus）流過來之血液
C. 岩下竇（inferior petrosal sinus）內之血液直接流向乙狀竇
D. 下矢狀竇（inferior sagittal sinus）內之血液直接流向岩上竇（superior petrosal sinus）

正確答案：D. 下矢狀竇（inferior sagittal sinus）內之血液直接流向岩上竇（superior petrosal sinus）